一位 55 歲健康狀況良好的男性因上鎖骨窩淋巴腺腫大求醫，下列檢查何者最不需要？
A. 頭頸部理學檢查
B. 淋巴腺穿刺細胞學檢查
C. 頭頸部磁振影像檢查
D. 胸部電腦斷層掃描

正確答案：C. 頭頸部磁振影像檢查